目前臺灣是一「高齡化、少子化」的社會，此敘述反應出下列何種人口金	塔？
A. 都市型
B. 農村型
C. 靜止型
D. 減少型

正確答案：D. 減少型